Clinical trial exclusion criterion:
patients who have suffered a neurologic event (seizure, stroke) or who have baseline dementia, both of which could limit delirium assessment

Annotated entities:
- Condition: "neurologic event"
- Condition: "seizure"
- Condition: "stroke"
- Condition: "baseline dementia"
- Non-representable: "both of which could limit delirium assessment"